何太太40歲育有一子，最近經常胸痛、盗、顫抖、同時會有呼吸困難，感覺自己快要窒息。症狀在約十分鐘內達到高峰，且發生時間不定，在睡眠時亦曾發生，在醫院做了很多檢查，都找不到器質性原因。最後在 林醫師門診吃藥後慢慢獲得改善， 林醫師的處方，最可能是那一種藥物？
A. isosorbide mononitrate
B. propylthiouracil
C. sertraline
D. digoxin

正確答案：C. sertraline